Current treatment with corticosteroids (topical or systemic), corticosteroid use within 3 months before possible start of trial treatment, or anticipated start of corticosteroid treatment within the first 2 years from the start of the trial period;

The above is a clinical trial exclusion criterion. Annotated with entity spans:
[Temporal: Current] treatment with [Drug: corticosteroids] ([Qualifier: topical] or [Qualifier: systemic]), [Procedure: corticosteroid use] [Temporal: within 3 months before possible start of trial treatment], or [Mood: anticipated] start of [Procedure: corticosteroid treatment] [Temporal: within the first 2 years from the start of the trial period];